La glucogénesis:
1. Es una vía muy activa en todos los tejidos.
2. Se activa por la insulina.
3. Todas sus reacciones se dan en la mitocondria.
4. Uno de sus sustratos es la ribosa.
5. Se produce en el hígado.

Respuesta correcta: 5. Se produce en el hígado.